OAT required for reasons not related to AF (i.e., prosthetic valve, PV stenosis, previous pulmonary embolism, presence of spontaneous echo contrast [SEC] at standard echo performed at 3-months follow-up).

The above is a clinical trial exclusion criterion. Annotated with entity spans:
[Drug: OAT] required for reasons [Negation: not] related to [Qualifier: AF] (i.e., [Device: prosthetic valve], [Condition: PV stenosis], previous [Condition: pulmonary embolism], presence of [Value: spontaneous echo contrast] [[Value: SEC]] at [Measurement: standard echo] performed at [Temporal: 3-months follow-up]).